Clinical trial inclusion criterion:
Diagnosis of idiopathic Parkinson's disease that is optimally treated (motor fluctuations <20% of subject's awake time). Subjects may be on levodopa therapy but must be stable at the time of entry into the study

Annotated entities:
- Condition: "idiopathic Parkinson's disease"
- Qualifier: "treated"
- Measurement: "motor fluctuations"
- Value: "<20% of subject's awake time"